Clinical trial exclusion criterion:
Known hypersensitivity or allergy to n-acetylcysteine, or receiving chronic therapy with medication that could interact adversely with n-acetylcysteine within 30 days prior to randomization (i.e., nitroglycerin, ACE inhibitors or antihypertensive drugs, anti-coagulants);

Entity relations:
- AND("hypersensitivity", "n-acetylcysteine")
- AND("chronic therapy", "n-acetylcysteine")
- Has_temporal("chronic therapy", "within 30 days prior to randomization")
- Subsumes("chronic therapy", "nitroglycerin")
- OR("hypersensitivity", "allergy")
- OR("nitroglycerin", "anti-coagulants", "ACE inhibitors", "antihypertensive drugs")